Subjects initiating new medications or patients on multiple medications may also be excluded.

The above is a clinical trial exclusion criterion. Annotated with entity spans:
[Non-query-able: Subjects initiating new medications or patients on multiple medications may also be excluded.]